Clinical trial exclusion criterion:
Unable to consent

Annotated entities:
- Non-query-able: "Unable to consent"